下列有關膀胱輸尿管逆流（vesicoureteral reflux）的敘述，何者錯誤？
A. 原發性膀胱輸尿管逆流與神經性膀胱有關
B. 膀胱炎亦能造成逆流
C. 青春期前孩童如果是國際分類第一至第三期的逆流，可先給予抗生素治療
D. 青春期女性如仍有逆流，應考慮手術治療

正確答案：A. 原發性膀胱輸尿管逆流與神經性膀胱有關